Clinical trial exclusion criterion:
Hydrocephalus with ventricular drain

Entity relations:
- AND("Hydrocephalus", "ventricular drain")